Clinical trial inclusion criterion:
History of coronary artery disease (MI/heart attack, stroke, heart failure, or peripheral artery disease)

Annotated entities:
- Condition: "coronary artery disease"
- Temporal: "History"
- Condition: "heart attack"
- Condition: "MI"
- Condition: "stroke"
- Condition: "heart failure"
- Condition: "peripheral artery disease"